一位 40 歲肥胖女性病患，接受骨盆腔手術後第三天突然呈現喘鳴及嚴重呼吸困難。病人的呼吸次數為 38/分，心跳為 120/分。本病人的症狀最大可能原因為：
A. 血糖過高
B. 敗血症
C. 傷口疼痛
D. 肺部血管栓塞

正確答案：D. 肺部血管栓塞